有關良性骨病灶影像學上之發現的敘述，下列何者正確？
A. 侵犯到脊椎椎體之嗜伊紅球性肉芽腫（eosinophilic granuloma）的X光片中，常可見到椎體扁平（vertebra plana）的變形
B. 骨樣骨瘤（osteoid osteoma）在電腦斷層檢查的中心病灶，大於2公分者居多
C. 纖維性發育不良（fibrous dysplasia）常發生在肱骨（humerus）近端，X光有類似牧羊人拐杖（shepherd's crook）的變形
D. 單純性骨囊腫（simple bone cyst）的磁振造影（MRI）檢查，幾乎都可見到流體液平面（fluid-fluid level）的影像

正確答案：A. 侵犯到脊椎椎體之嗜伊紅球性肉芽腫（eosinophilic granuloma）的X光片中，常可見到椎體扁平（vertebra plana）的變形